Male or female subjects, aged >=40 years. Females must be of Non Child Bearing Potential. The definition of Non Child Bearing Potential is as following: Females, regardless of their age, with functioning ovaries and who have a current documented tubal ligation or hysterectomy, or females who are post-menopausal.

The above is a clinical trial inclusion criterion. Annotated with entity spans:
[Person: Male] or [Person: female] subjects, [Person: aged] [Value: >=40 years]. [Person: Females] must be of [Negation: Non] [Condition: Child Bearing Potential]. The definition of [Negation: Non] [Condition: Child Bearing Potential] is as following: [Person: Females], regardless of their age, with [Condition: functioning ovaries] and who have a current documented [Condition: tubal ligation] or [Condition: hysterectomy], or [Person: females] who are [Condition: post-menopausal].